Clinical trial inclusion criterion:
BMI 25.0 - 45.0 kg/m2

Annotated entities:
- Measurement: "BMI"
- Value: "25.0 - 45.0 kg/m2"